Clinical trial inclusion criteria:
Female at birth and identifies as female gender
Age 18 years or older
Able to understand and provide consent in English or Spanish
HIV negative by 4th generation test (Ag/Ab test) or combination of enzymeimmunoassay (EIA) and HIV RNA
Creatinine clearance = 60 ml/min (via Cockcroft-Gault formula)
Condomless sex in the last 3 months with one or more male partners of unknown HIV status known to be at substantial risk of HIV infection (IDU, bisexual, sex for goods, recently incarcerated, from a country with HIV prevalence >1%, interpersonal Partner Violence);
STI (rectal or vaginal gonorrhea or syphilis) diagnosis during the last 6 months.
Previous post-exposure prophylaxis (PEP) use during the last 12 months.
Has at least one HIV-infected sexual partner for =4 weeks.
Sex for exchange of money, goods or services

Annotated entities:
- Person: "Female"
- Temporal: "at birth"
- Reference_point: "birth"
- Person: "gender"
- Value: "female"
- Person: "Age"
- Value: "18 years or older"
- Post-eligibility: "Able to understand and provide consent in English or Spanish"
- Measurement: "HIV 4th generation test"
- Value: "negative"
- Measurement: "Ag/Ab test"
- Measurement: "enzymeimmunoassay"
- Measurement: "HIV RNA"
- Measurement: "EIA"
- Measurement: "Creatinine clearance"
- Value: "= 60 ml/min"
- Measurement: "Cockcroft-Gault formula"
- Observation: "Condomless sex"
- Temporal: "in the last 3 months"
- Multiplier: "one or more"
- Person: "male partners"
- Condition: "unknown HIV status"
- Observation: "substantial risk of HIV infection"
- Condition: "HIV infection"
- Observation: "IDU"
- Observation: "bisexual"
- Observation: "sex for goods"
- Observation: "recently incarcerated"
- Observation: "from a country with HIV prevalence >1%"
- Observation: "interpersonal Partner Violence"
- Condition: "STI"
- Condition: "syphilis"
- Condition: "vaginal gonorrhea"
- Condition: "rectal gonorrhea"
- Temporal: "during the last 6 months"
- Procedure: "post-exposure prophylaxis use"
- Procedure: "PEP"
- Temporal: "during the last 12 months"
- Multiplier: "at least one"
- Observation: "sexual partner"
- Condition: "HIV-infected"
- Value: "=4 weeks"
- Observation: "Sex for exchange of money, goods or services"